La glucólisis es la única ruta productora de ATP en:
1. Eritrocitos.
2. Linfocitos.
3. Hepatocitos.
4. Neuronas.
5. Adipocitos.

Respuesta correcta: 1. Eritrocitos.